Clinical trial exclusion criterion:
Patients receiving injection to treatment knee within 2 months of study enrollment

Annotated entities:
- Procedure: "injection"
- Qualifier: "knee"
- Temporal: "within 2 months of study enrollment"
- Reference_point: "study enrollment"